Clinical trial exclusion criterion:
History of alcohol or drug abuse (as defined by the current version of the DSM) within 2 years before the first dose administration, or positive alcohol or drug screen.

Annotated entities:
- Condition: "alcohol abuse"
- Condition: "drug abuse"
- Temporal: "History"
- Procedure: "current version of the DSM"
- Temporal: "within 2 years before"
- Reference_point: "the first dose administration"
- Measurement: "alcohol screen"
- Measurement: "drug screen"
- Value: "positive"